Clinical trial inclusion criteria:
Is between 18 and 40 years of age (inclusive)
Has had a self-reported visual exam in the last two years
Is an adapted Avaira sphere contact lens wearer (at least 1 week in Avaira sphere)
Has a contact lens spherical prescription between + 2.25 to - 8.00 (inclusive)
Has a spectacle cylinder up to 0.75D in each eye.
Can achieve best corrected spectacle distance visual acuity of 20/25 (0.10 logMAR) or better in each eye.
Can achieve a distance visual acuity of 20/30 (0.18 logMAR) or better in each eye with the study contact lenses.
Has clear corneas and no active ocular disease
Has read, understood and signed the information consent letter.
Patient contact lens refraction should fit within the available parameters of the study lenses.
Is willing to comply with the wear schedule (at least 5 days per week, > 8 hours/day assuming there are no contraindications for doing so).
Is willing to comply with the visit schedule

Annotated entities:
- Value: "between 18 and 40 years (inclusive)"
- Person: "age"
- Procedure: "self-reported visual exam"
- Temporal: "in the last two years"
- Device: "Avaira sphere contact lens"
- Temporal: "at least 1 week in Avaira sphere"
- Reference_point: "Avaira sphere"
- Device: "Avaira sphere"
- Device: "contact lens"
- Value: "+ 2.25 to - 8.00 (inclusive)"
- Qualifier: "spherical"
- Device: "spectacle cylinder"
- Value: "up to 0.75D"
- Measurement: "best corrected spectacle distance visual acuity"
- Value: "20/25 or better"
- Value: "0.10 logMAR or better"
- Measurement: "distance visual acuity"
- Value: "20/30 or better"
- Value: "0.18 logMAR or better"
- Device: "study contact lenses"
- Condition: "clear corneas"
- Condition: "ocular disease"
- Negation: "no"
- Temporal: "active"
- Post-eligibility: "Has read, understood and signed the information consent letter."
- Non-query-able: "Has read, understood and signed the information consent letter."
- Non-query-able: "Patient contact lens refraction should fit within the available parameters of the study lenses."
- Context_Error: "Patient contact lens refraction should fit within the available parameters of the study lenses."
- Non-query-able: "Is willing to comply with the wear schedule (at least 5 days per week, > 8 hours/day assuming there are no contraindications for doing so)."
- Post-eligibility: "Is willing to comply with the wear schedule (at least 5 days per week, > 8 hours/day assuming there are no contraindications for doing so)."
- Non-query-able: "Is willing to comply with the visit schedule"
- Post-eligibility: "Is willing to comply with the visit schedule"